Clinical trial exclusion criterion:
Projected life expectancy less than 30 days

Annotated entities:
- Observation: "Projected life expectancy"
- Value: "less than 30 days"